Clinical trial inclusion criterion:
New York Heart Association (NYHA) class of II - IV

Annotated entities:
- Measurement: "New York Heart Association class"
- Value: "II - IV"
- Measurement: "NYHA"